Clinical trial exclusion criterion:
Abnormal karyotype

Annotated entities:
- Condition: "Abnormal karyotype"